The patient or guardian agrees to the study protocol and the schedule of clinical and dynamic SPECT follow-up, and provides informed, written consent, as approved by the appropriate Institutional Review Board/Ethical Committee of the respective clinical site.

The above is a clinical trial inclusion criterion. Annotated with entity spans:
The patient or guardian agrees to the study protocol and the schedule of clinical and dynamic SPECT follow-up, and provides [Informed_consent: informed, written consent], as approved by the appropriate Institutional Review Board/Ethical Committee of the respective clinical site.